臨床上偶見雙側卵巢轉移癌（Krukenberg tumor），最可能由何種細胞型態的消化系原發癌發生轉移？
A. 鱗狀上皮細胞癌
B. 不分泌黏液之腺癌
C. 分泌黏液之腺癌
D. 肝細胞癌

正確答案：C. 分泌黏液之腺癌